Current systemic steroid use

The above is a clinical trial exclusion criterion. Annotated with entity spans:
[Temporal: Current] [Procedure: systemic steroid use]